Clinical trial inclusion criterion:
presenting good health conditions

Annotated entities:
- Condition: "good health conditions"